Clinical trial inclusion criterion:
with mechanical ventilation initiated in the first 48 hours following hospital admission

Entity relations:
- Has_temporal("mechanical ventilation", "first 48 hours following hospital admission")
- Has_index("first 48 hours following hospital admission", "hospital admission")